Glutathione在細胞內參與氧化還原反應，它是由那三種胺基酸所構成之三胜肽（tripeptide）?
A. methionine, glutamate, cysteine
B. glutamate, cysteine, glycine
C. alanine, methionine, glutamate
D. arginine, aspartic acid, methionine

正確答案：B. glutamate, cysteine, glycine